Clinical trial inclusion criterion:
absence of peritoneal carcinomatosis, central nervous system o bone metastasis.

Entity relations:
- Has_negation("peritoneal carcinomatosis", "absence")
- OR("peritoneal carcinomatosis", "bone metastasis", "central nervous system metastasis")